Clinical trial exclusion criterion:
Inability to swallow capsules

Annotated entities:
- Condition: "Inability to swallow capsules"